What do statins do?

Statins lower high cholesterol